Evidence of a clinically significant neurological disease that might affect cognition (e.g., delirium, dementia, epilepsy, head trauma, and multiple sclerosis)

The above is a clinical trial exclusion criterion. Annotated with entity spans:
[Mood: Evidence] of a [Qualifier: clinically significant] [Condition: neurological disease] that [Qualifier: might affect cognition] (e.g., [Condition: delirium], [Condition: dementia], [Condition: epilepsy], [Condition: head trauma], and [Condition: multiple sclerosis])